Clinical trial exclusion criterion:
Patients with fluid restriction or who are unable to drink up to 900 ml of fluid within 10 minutes prior to the VCE

Entity relations:
- multi("the VCE", "VCE")
- Has_index("prior to the VCE", "the VCE")
- Has_temporal("fluid restriction", "prior to the VCE")
- OR("fluid restriction", "unable to drink")